Which is the target of belimumab in Systemic Lupus Erythematosus treatment?

Belimumab: a BLyS-specific inhibitor for systemic lupus erythematosus To review the efficacy, safety, dosing, drug interactions, as well as economic and therapeutic considerations of belimumab, an investigational B-lymphocyte stimulator (BLyS) inhibitor. Belimumab, an anti-BAFF monoclonal antibody